下列何者通過橫膈（diaphragm）的食道裂口（esophageal opening）？
A. 迷走神經
B. 膈神經
C. 下腔靜脈
D. 胸管

正確答案：A. 迷走神經